Age 18 to 65.

The above is a clinical trial inclusion criterion. Annotated with entity spans:
[Person: Age] [Value: 18 to 65].